What is the effect of Dkk1 in Wnt signaling?

DKK1 is a secreted protein that antagonizes Wnt signaling and plays essential roles in vertebrate embryogenesis.